Hydrosalpinx.

The above is a clinical trial exclusion criterion. Annotated with entity spans:
[Condition: Hydrosalpinx].